Hgb =8.5 g/dL and =11.5 g/dL

The above is a clinical trial inclusion criterion. Annotated with entity spans:
[Measurement: Hgb] [Value: =8.5 g/dL and =11.5 g/dL]